Clinical trial exclusion criterion:
Current use of laxatives, antacids, or other agents to lower stomach acidity?

Annotated entities:
- Drug: "laxatives"
- Drug: "antacids"
- Drug: "agents to lower stomach acidity"
- Qualifier: "other"